Clinical trial inclusion criteria:
Subject or legal representative has voluntarily signed the informed consent approved by the Institutional Review Board,
Hip fracture surgery scheduled under general anesthesia
Subject is 65 years or older on the day of surgery

Annotated entities:
- Informed_consent: "Subject or legal representative has voluntarily signed the informed consent approved by the Institutional Review Board,"
- Procedure: "Hip fracture surgery"
- Procedure: "general anesthesia"
- Value: "65 years or older"
- Temporal: "on the day of surgery"
- Reference_point: "the day of surgery"
- Procedure: "surgery"
- Person: "older"